En el ámbito de la salud mental, la palabra cronicidad:
1. No se emplea con relación a los trastornos mentales.
2. Se sustituye por el término Trastorno Mental Grave (TMG).
3. Se comenzó a emplear con la reforma psiquiátrica.
4. Se relaciona con el de enfermedad mental aguda.
5. Es un concepto neutro, sin connotaciones negativas.

Respuesta correcta: 2. Se sustituye por el término Trastorno Mental Grave (TMG).